Clinical trial exclusion criterion:
patient's refusal

Annotated entities:
- Informed_consent: "patient's refusal"